Significant arterial disease (Ankle Brachial Pressure Index <0•9 or evidence on Arterial Duplex)

The above is a clinical trial exclusion criterion. Annotated with entity spans:
[Qualifier: Significant] [Condition: arterial disease] ([Measurement: Ankle Brachial Pressure Index] [Value: <0•9] or evidence on [Procedure: Arterial Duplex])